Clinical trial exclusion criterion:
Myasthenia gravis

Annotated entities:
- Condition: "Myasthenia gravis"